Elevated liver enzymes;

The above is a clinical trial exclusion criterion. Annotated with entity spans:
[Condition: Elevated liver enzymes];